Clinical trial exclusion criterion:
8. History of Hepatitis B, C, or HIV

Entity relations:
- Has_temporal("Hepatitis B", "History")
- OR("Hepatitis B", "HIV", "Hepatitis C")